Clinical trial inclusion criterion:
Gestational age >33 weeks at time of delivery

Annotated entities:
- Measurement: "Gestational age"
- Value: ">33 weeks"
- Temporal: "at time of delivery"